What organism causes hepatic capillariasis?

Hepatic capillariasis is a rare and neglected parasitic disease caused by infection with Capillaria hepatica in human liver.